women

The above is a clinical trial inclusion criterion. Annotated with entity spans:
[Person: women]